下列那種細胞激素具有免疫抑制作用？
A. IL-2
B. TNF-α
C. TGF-β
D. MCP-1

正確答案：C. TGF-β